劇烈運動中的肌細胞與靜止時之肌細胞相比，前者會產生下列何種現象？
A. lactate 形成之速率較高
B. gluconeogenesis 增加
C. glucose 之消耗較低
D. glycogenolysis 較低 39 	Tay-Sachs 是一種人類遺傳性疾病，下列相關敘述何者錯誤？

正確答案：A. lactate 形成之速率較高